關於結核病（tuberculosis）的敘述，下列何者正確？
A. primary pulmonary tuberculosis 好發於肺部的中、下區（middle & lower zone）
B. 初次感染結核病程的 Ghon lesion 是頸部淋巴結鈣化形成的病灶
C. 結核病在宿主體內不會經血路散布至全身
D. 預防結核病感染的疫苗是 PPD

正確答案：A. primary pulmonary tuberculosis 好發於肺部的中、下區（middle & lower zone）